El desenrollamiento y el superenrollamiento del DNA están controlados por las:
1. Helicasas.
2. Topoisomerasas.
3. DNA ligasas.
4. Telomerasas.
5. DNA polimerasa.

Respuesta correcta: 2. Topoisomerasas.